What is the chromosomal abnormality associated with Klinefelter Syndrome

About 1 in 650 boys are born with an extra X chromosome (47,XXY or Klinefelter syndrome). 47,XXY